Active bleeding or known bleeding disorder/diathesis

The above is a clinical trial exclusion criterion. Annotated with entity spans:
[Condition: Active bleeding] or known [Condition: bleeding disorder]/[Condition: diathesis]